Señale la RESPUESTA INCORRECTA sobre el protocolo de tratamiento psicológico para la fobia social propuesto por D.M. Clark, A.Wells y colaboradores:
1. Recurre con frecuencia a experimentos conductuales.
2. Incluye el abandono de comportamientos de seguridad.
3. Se aplica casi siempre en formato grupal.
4. Utiliza técnicas para modificar la autoimagen distorsionada.
5. Se instiga al paciente a que pregunte a otras personas sobre sus creencias.

Respuesta correcta: 3. Se aplica casi siempre en formato grupal.